Inadequate understanding about the study

The above is a clinical trial exclusion criterion. Annotated with entity spans:
[Observation: Inadequate understanding about the study]